Clinical trial inclusion criterion:
Accepted for CABG surgery

Annotated entities:
- Procedure: "CABG surgery"
- Mood: "Accepted for"